What is the Bartter syndrome?

Bartter syndrome is a rare disorder characterized by reduced sodium chloride transport in the distal nephrons of the kidney.